Active infection requiring systemic treatment,

The above is a clinical trial exclusion criterion. Annotated with entity spans:
Active [Condition: infection] [Qualifier: requiring systemic treatment],